Clinical trial inclusion criterion:
Total bilirubin ≤ 1.5 X the upper limit of normal (ULN) unless a known history of impaired bilirubin conjugation such as Gilbert's, for whom the maximum will be 2.5 ULN.

Entity relations:
- Subsumes("impaired bilirubin conjugation", "Gilbert's")
- AND("maximum 2.5 ULN", "impaired bilirubin conjugation")
- Has_value("Total bilirubin", "≤ 1.5 X the upper limit of normal (ULN)")
- OR("≤ 1.5 X the upper limit of normal (ULN)", "maximum 2.5 ULN")